Clinical trial exclusion criterion:
deep vein thrombosis

Annotated entities:
- Condition: "deep vein thrombosis"